Which proteins remove H2A.Z in the yeast Saccharomyces cerevisiae?

Budding yeast INO80 can remove H2A.Z/H2B dimers from chromatin and replace them with H2A/H2B dimers. H2A.Z removal from chromatin is the primary function of INO80 and ANP32E in promoting homologous recombination.